Clinical trial exclusion criterion:
Acute rejection episode in the last 30 days, or episode > 2A in the Banff criteria;

Entity relations:
- Has_value("Banff criteria", "> 2A")
- Has_temporal("Acute rejection episode", "last 30 days")
- OR("Acute rejection episode", "Banff criteria")